Clinical trial exclusion criterion:
Body Mass Index >29.9

Annotated entities:
- Measurement: "Body Mass Index"
- Value: ">29.9"